Está asociado a úlceras y cánceres gástricos:
1. Clostridium botulinum.
2. Yersinia enterocolitica.
3. Salmonella enterica.
4. Helicobacter pylori.
5. Shigella sonnei.

Respuesta correcta: 4. Helicobacter pylori.